Age 18-64 Enrollment will be limited to adults younger than 65 years because of the increased risk of adverse medication effects in the elderly.

The above is a clinical trial inclusion criterion. Annotated with entity spans:
[Person: Age] [Value: 18-64] Enrollment will be limited to [Person: adults] [Value: younger than 65 years] because of the [Mood: increased risk] of [Condition: adverse] [Drug: medication] effects in the [Person: elderly].